Clinical trial inclusion criterion:
AAT deficient patients who are either naïve (not receiving IV augmentation therapy) or AAT deficient patients (receiving IV augmentation therapy), if they have been stable on regular therapy for at least 3 months prior to the screening visit and are willing to continue the same regime throughout this trial. Note that only sites in Germany can recruit patients who are currently being treated with IV AAT.Patients who stopped IV augmentation treatment 6 months prior to screening date and will not re-start this treatment for the course of the study will be considered Naïve.

Entity relations:
- Has_negation("IV augmentation therapy", "not receiving")
- Subsumes("naïve", "IV augmentation therapy")
- AND("AAT deficient", "naïve")
- Has_index("for at least 3 months prior to the screening", "the screening")
- Has_index("throughout this trial", "this trial")
- Has_temporal("willing to continue", "throughout this trial")
- Has_temporal("therapy", "for at least 3 months prior to the screening")
- Has_qualifier("therapy", "stable")
- OR("naïve", "IV augmentation therapy")